Clinical trial exclusion criterion:
Patients taking anticoagulant medication

Annotated entities:
- Drug: "anticoagulant"